Clinical trial inclusion criteria:
De novo kidney transplants
20 - 65 years old
aspartate aminotransferase/alanine aminotransferase within 2 times the upper limit of normal range

Annotated entities:
- Procedure: "kidney transplants"
- Qualifier: "De novo"
- Person: "old"
- Value: "20 - 65 years"
- Measurement: "alanine aminotransferase"
- Measurement: "aspartate aminotransferase"
- Value: "within 2 times the upper limit of normal range"